Clinical trial inclusion criterion:
1. Women 18 to 40 years of age inclusive who can give written informed consent

Annotated entities:
- Person: "Women"
- Value: "18 to 40 years"
- Person: "age"
- Observation: "can give written informed consent"
- Post-eligibility: "can give written informed consent"